Clinical trial inclusion criterion:
Subjects with a measured post-albuterol/salbutamol FEV1 >=50 and <=70% of predicted normal values calculated using NHANES III reference equations [Hankinson, 1999; Hankinson, 2010] at Screening (Visit 1).

Entity relations:
- Has_temporal("post-albuterol/salbutamol", "post-albuterol/salbutamol")
- Has_index("post-albuterol/salbutamol", "albuterol/salbutamol")
- Has_qualifier("FEV1", "post-albuterol/salbutamol")
- Has_value("FEV1", ">=50 and <=70% of predicted normal values")
- Has_qualifier(">=50 and <=70% of predicted normal values", "using NHANES III reference equations")
- Has_index("at Screening", "Screening")
- Has_temporal("FEV1", "at Screening")